HYPERTENSIVE: known cardiovascular disease or risk factors aside from hypertension or use of cardiac medications

The above is a clinical trial exclusion criterion. Annotated with entity spans:
[Condition: HYPERTENSIVE]: known [Condition: cardiovascular disease] or risk factors [Negation: aside from] hypertension or use of [Drug: cardiac medications]